Serum ferritin level < 20 ng/mL at screening.

The above is a clinical trial exclusion criterion. Annotated with entity spans:
[Measurement: Serum ferritin] level [Value: < 20 ng/mL] at screening.